FSH levels < 10 mIU/ml

The above is a clinical trial inclusion criterion. Annotated with entity spans:
[Measurement: FSH levels] [Value: < 10 mIU/ml]